主動瓣脈逆流（aortic regurgitation）的病人，可藉由下列何種代償作用減緩循環缺失（circulatory insufficiency）的嚴重性？
A. 右心室肥大
B. 血量增加
C. 腎臟排出鹽和水的量增加
D. 心房利鈉肽（atrial natriuretic peptide）分泌增加

正確答案：B. 血量增加